Aged under 18,

The above is a clinical trial exclusion criterion. Annotated with entity spans:
[Person: Aged] [Value: under 18],